Which gene is primarily associated with the Saethre-Chotzen syndrome?

Mutations in the TWIST1 gene, encoding the syntaxin binding protein 1, have been described as the cause of the Saethre-Chotzen syndrome.